Past history of claustrophobia.

The above is a clinical trial exclusion criterion. Annotated with entity spans:
Past history of [Condition: claustrophobia].